Clinical trial inclusion criterion:
ECOG performance status 2.

Annotated entities:
- Measurement: "ECOG performance status"
- Value: "2"